Clinical trial exclusion criterion:
4. Joint contractures

Annotated entities:
- Parsing_Error: "4."
- Condition: "Joint contractures"